Clinical trial exclusion criterion:
(1) Uterine abnormalities (e.g. septate, bicornuate and fibroid uterus, Asherman Syndrome).

Annotated entities:
- Condition: "Uterine abnormalities"
- Condition: "septate uterus"
- Condition: "bicornuate uterus"
- Condition: "fibroid uterus"
- Condition: "Asherman Syndrome"